Clinical trial exclusion criterion:
Subject has stool positive for ova and parasite and for Clostridium difficule toxins within 3 months prior to enrollment.

Annotated entities:
- Measurement: "stool"
- Value: "positive for ova"
- Value: "parasite positive for"
- Value: "Clostridium difficule toxins positive for"
- Temporal: "within 3 months prior"
- Reference_point: "enrollment"